Body mass index (BMI)range 20-50 (excluding all women with BMI under 20 or over 50).

The above is a clinical trial exclusion criterion. Annotated with entity spans:
[Measurement: Body mass index (BMI)][Value: range 20-50] [Parsing_Error: (excluding all women with BMI under 20 or over 50)].